Clinical trial exclusion criteria:
Enrollment in another trial
Lack of consent

Annotated entities:
- Competing_trial: "Enrollment in another trial"
- Informed_consent: "Lack of consent"